人體蟯蟲（Enterobius vermicularis）感染最常使用的診斷方法為何？
A. 直接塗抹法（Direct wet film method）
B. 玻璃膠紙肛圍擦拭法（Cellophane tape perianal swabs method）
C. 福馬林－乙醚濃縮法（Formol-ether concentration technique）
D. 飽和食鹽水浮游法（Saturated sodium chloride solution floating method）

正確答案：B. 玻璃膠紙肛圍擦拭法（Cellophane tape perianal swabs method）